What is the function of GvpA?

the gas vesicle wall is solely formed of proteins with the two major components, gvpa and gvpc,